Patients who have already received an epidural during this admission or requiring general anesthesia for cesarean birth

The above is a clinical trial exclusion criterion. Annotated with entity spans:
Patients who have already received an [Procedure: epidural] [Temporal: during this admission] or [Mood: requiring] [Procedure: general anesthesia] for [Procedure: cesarean birth]